下列何種胰臟囊狀病灶（pancreatic cystic lesion）好發於女性？①漿液性囊狀腺瘤（serous cystadenoma） ②胰管內乳突黏液性腫瘤（intraductal papillary mucinous tumor） ③實體偽乳突腫瘤（solid-pseudopapillary tumor） ④黏液性囊狀腺瘤（mucinous cystic neoplasm） ⑤假性囊腫 （pseudocyst）
A. ①②④
B. ①③④
C. ①④⑤
D. ②③⑤

正確答案：B. ①③④